Having received standard HF therapy for at least 2 weeks, having reached target dose or max tolerable dose.

The above is a clinical trial inclusion criterion. Annotated with entity spans:
Having received [Procedure: standard HF therapy] [Temporal: for at least 2 weeks], having reached [Multiplier: target dose] or [Multiplier: max tolerable dose].